Clinical trial exclusion criterion:
Digital Sympathectomy or botulinum toxin injection planned in the following month.

Annotated entities:
- Procedure: "Digital Sympathectomy"
- Procedure: "botulinum toxin injection"
- Mood: "planned"
- Non-query-able: "planned"
- Temporal: "in the following month"